Clinical trial exclusion criterion:
Not received neuraxial anesthesia

Entity relations:
- Has_negation("neuraxial anesthesia", "Not received")